Constant habitual activity patterns (no deviation > 1x/wk at 30 min/session within last 3 months)

The above is a clinical trial inclusion criterion. Annotated with entity spans:
[Condition: Constant habitual activity patterns] ([Observation: no deviation > 1x/wk at 30 min/session within last 3 months])